萬一你伯父打電話給你說，他 30 分鐘前開始左邊手腳乏力，口齒不清。你應建議他：
A. 趕快到急診處，不要延誤
B. 應注意門診掛號要直接掛神經內科
C. 門診掛號宜先掛一般內科較妥
D. 應先檢查脈搏與血壓

正確答案：A. 趕快到急診處，不要延誤